Subject with other known infectious cause of abdominal symptoms.

The above is a clinical trial exclusion criterion. Annotated with entity spans:
Subject with [Context_Error: other known infectious cause of abdominal symptoms].